兒童佝僂症（Rickets）常因體內鈣磷代謝異常所導致，下列那一項致病機轉所造成的佝僂症與其他最不相同？
A. 慢性腎臟病（Chronic kidney disease）
B. 低血磷佝僂症（Hypophosphatemic rickets）
C. 腸胃吸收障礙（Malabsorption）
D. 營養不良致維生素D缺乏（Nutritional vitamin D deficiency）

正確答案：B. 低血磷佝僂症（Hypophosphatemic rickets）